下列那一個 sign 不會出現在 Sigmoid colon volvulus 之 Plain abdominal X-ray film 上？
A. "Bent inner tube＂sign
B. "Bird's beak＂deformity
C. Absent rectal gas
D. Air-fluid level in dilated colon loop

正確答案：B. "Bird's beak＂deformity